在 B 型肝炎病毒造成急性感染之患者身上，下列何種抗體最早出現？
A. Anti-HBc
B. Anti-PreS
C. Anti-HBs
D. Anti-HBe

正確答案：A. Anti-HBc